Clinical trial inclusion criterion:
Patient has received an organ transplant or is on a waiting list for an organ transplant

Annotated entities:
- Procedure: "organ transplant"
- Mood: "is on a waiting list"
- Procedure: "organ transplant"